Clinical trial inclusion criterion:
Age >/=18 years at screening

Entity relations:
- Has_value("Age", ">/=18 years")
- Has_temporal("Age", "at screening")